40 餘歲孕婦患有甲狀腺功能過高、出現抗促甲狀腺荷爾蒙受體抗體（anti-TSH receptor antibody）的葛瑞夫氏症（Graves' disease）。順利生產後，發現小嬰孩 2000 公克重，易受驚，極不易入睡，喝奶量低，檢查體內亦有抗促甲狀腺荷爾蒙受體抗體。原因為何？
A. 本例是因為葛瑞夫氏症的遺傳所致
B. 母親的自體免疫疾病之抗促甲狀腺荷爾蒙受體抗體是 IgG，能通過胎盤，而暫時引起小嬰孩的病徵
C. 葛瑞夫氏症的特性引起小嬰孩體內的CD4+ CD25+調節型T細胞（CD4+ CD25+ Treg細胞）增加
D. 葛瑞夫氏症的特性引起小嬰孩體內的抗乙醯膽鹼受體抗體（anti-acetylcholine receptor antibody）增加

正確答案：B. 母親的自體免疫疾病之抗促甲狀腺荷爾蒙受體抗體是 IgG，能通過胎盤，而暫時引起小嬰孩的病徵